Chronic preoperative opioid consumption.

The above is a clinical trial exclusion criterion. Annotated with entity spans:
[Qualifier: Chronic] [Temporal: preoperative] [Drug: opioid] consumption.